下列何肌在呼吸時有穩固肋骨的作用？
A. 腰大肌（psoas major）
B. 腰小肌（psoas minor）
C. 腰方肌（quadratus lumborum）
D. 髂肌（iliacus）

正確答案：C. 腰方肌（quadratus lumborum）